Clinical trial exclusion criterion:
Subject with a history of syncope within the last 6 months prior to screening

Entity relations:
- Has_temporal("syncope", "within the last 6 months prior to screening")
- Has_index("within the last 6 months prior to screening", "screening")